Clinical trial exclusion criterion:
Immune disorders

Annotated entities:
- Condition: "Immune disorders"